Primary language spoken that is not English or Spanish

The above is a clinical trial exclusion criterion. Annotated with entity spans:
[Non-query-able: Primary language spoken that is not English or Spanish]